able to walk independently for 30 metres with or without an assistive device.

The above is a clinical trial inclusion criterion. Annotated with entity spans:
[Condition: able to walk independently] [Multiplier: for 30 metres] with or without an assistive device.